Which was  the first oral drug for the treatment of multiple sclerosis by the US Food and Drug Administration (FDA)?

FTY720 (Fingolimod) was approved as the first oral drug for the treatment of multiple sclerosis by the US Food and Drug Administration (FDA) in 2010.